El pirofosfato de tiamina (PPT) no es coenzima de:
1. Piruvato deshidrogenasa (síntesis de acetilCoA).
2. Alfa-cetoglutarato deshidrogenasa (ciclo del ácido cítrico).
3. Transcetolasa (ruta de las pentosas fosfato).
4. Transaldolasa (ruta de las pentosas fosfato).
5. Piruvato descarboxilasa (fermentación etanólica).

Respuesta correcta: 4. Transaldolasa (ruta de las pentosas fosfato).